Leukocytosis (>10.000 cells/mm3), leftward shift (>10%) or leucopenia (<4000 cells/mm3)

The above is a clinical trial inclusion criterion. Annotated with entity spans:
[Condition: Leukocytosis] ([Multiplier: >10.000 cells/mm3]), [Multiplier: leftward shift] (>10%) or [Condition: leucopenia] ([Multiplier: <4000 cells/mm3])